利用支架（orthosis）來協助股四頭肌無力（quadriceps weakness）伴隨膝退化性關節炎（knee OA）之病人站立完全伸展時，下列何者最不合適？
A. 膝裝具（knee orthosis）
B. 膝踝足裝具（KAFO）
C. 思奇膝踝足裝具（Scott-Craig KAFO）
D. 髖膝踝足裝具（HKAFO）

正確答案：D. 髖膝踝足裝具（HKAFO）